Subject has any open wounds.

The above is a clinical trial inclusion criterion. Annotated with entity spans:
Subject has any [Condition: open wounds].